What is Dravet syndrome?

Dravet syndrome is one of the most severe epilepsy syndromes of early childhood, and is associated with high morbidity and mortality. The typical presentation is characterized by hemiclonic or generalized clonic seizures triggered by fever during the first year of life, followed by myoclonic, absence, focal and generalized tonic-clonic seizures.